Clinical trial exclusion criterion:
Had a history of, or ongoing, chronic or recurrent infectious disease

Annotated entities:
- Qualifier: "recurrent"
- Qualifier: "chronic"
- Temporal: "ongoing"
- Temporal: "history"
- Condition: "infectious disease"